Clinical trial inclusion criterion:
CNS disease

Annotated entities:
- Condition: "CNS disease"